Uno de los siguientes tipos de transporte a través de membranas NO existe:
1. Transporte iónico facilitado por ionóforo (en contra de gradiente electroquímico).
2. Difusión facilitada (a favor de gradiente electroquímico)
3. Transporte activo primario (en contra de gradiente electroquímico).
4. Canal iónico (a favor de gradiente electroquímico).
5. Difusión simple (a favor de gradiente de concentración).

Respuesta correcta: 1. Transporte iónico facilitado por ionóforo (en contra de gradiente electroquímico).